下列何種藥物不是可造成病人喪失意識之靜脈全身麻醉藥物？
A. Propofol
B. Diazepam
C. Neostigmine
D. Midazolam

正確答案：C. Neostigmine